Clinical trial inclusion criterion:
Hypersensitivity or allergy to one of the study drugs

Annotated entities:
- Condition: "Hypersensitivity"
- Condition: "allergy"
- Drug: "study drugs"